Clinical trial inclusion criterion:
medical indication for induction of labor

Entity relations:
- AND("medical indication", "induction of labor")